Clinical trial exclusion criterion:
known or presumed abnormal coagulation status

Entity relations:
- Has_qualifier("abnormal coagulation status", "known")
- OR("known", "presumed")